Clinical trial exclusion criterion:
Has ever received any cytotoxic drugs, including chlorambucil, cyclophosphamide, nitrogen mustard, or other alkylating agents

Annotated entities:
- Drug: "cytotoxic drugs"
- Drug: "chlorambucil"
- Drug: "cyclophosphamide"
- Drug: "nitrogen mustard"
- Drug: "alkylating agents"